Urine cotinine level ? 100 ng/ml (NicAlert(r) reading ? 3)

The above is a clinical trial inclusion criterion. Annotated with entity spans:
[Measurement: Urine cotinine level] [Value: ? 100 ng/ml] ([Measurement: NicAlert(r)] reading [Value: ? 3])